Anaphylactic reaction to a previous dose of influenza vaccine or to any of its components

The above is a clinical trial exclusion criterion. Annotated with entity spans:
[Condition: Anaphylactic reaction] to a [Temporal: previous] dose of [Drug: influenza vaccine] or to any of [Drug: its components]